Physically and neurologically healthy [confirmed by a comprehensive medical history]

The above is a clinical trial inclusion criterion. Annotated with entity spans:
Physically and [Condition: neurologically healthy] [confirmed by a [Procedure: comprehensive medical history]]